¿Qué tipo de memoria podemos utilizar para planificar lo que tenemos que hacer para llegar a tiempo a una cita el próximo martes?
1. Memoria prospectiva.
2. Memoria autobiográfica.
3. Memoria episódica.
4. Memoria semántica.
5. Memoria procedimental.

Respuesta correcta: 1. Memoria prospectiva.